33歲女性因爲持續發燒1個多月前來求診。病人12歲時曾因下肢紫斑與牙齦出血在其他醫院診斷為「自體免疫血小板低下」，經類固醇治療約半年左右就病情穩定也未再回診。初步實	室檢	白血球（WBC）， 5 g/dL，血小板60,000/ µL，尿液常規有蛋白尿protein 3+，血尿RBC 10～20/HPF。下列何項檢查對確立診斷最有幫助？
A. C-反應蛋白（CRP）
B. 抗中性球細胞質抗體（antineutrophil cytoplasmic antibodies）
C. 抗核抗體（antinuclear antibodies）
D. 間接庫姆氏試	（indirect Coombs' test）

正確答案：C. 抗核抗體（antinuclear antibodies）